Invasively mechanically ventilated >72 hours at the time of screening;

The above is a clinical trial exclusion criterion. Annotated with entity spans:
Invasively [Procedure: mechanically ventilated] [Temporal: >72 hours] at the time of screening;